Clinical trial exclusion criterion:
Serious chronic illness.

Annotated entities:
- Qualifier: "Serious"
- Condition: "chronic illness"